Patients with posterior or posterolateral disc herniations at one level between L1 and S1 with radiographic confirmation of neural compression using CT and/or MRI.

The above is a clinical trial inclusion criterion. Annotated with entity spans:
Patients with [Qualifier: posterior] or [Qualifier: posterolateral] [Condition: disc herniations] at [Qualifier: one level between L1 and S1] with [Qualifier: radiographic confirmation] of [Condition: neural compression] using [Procedure: CT] and/or [Procedure: MRI].